下列何者是兒童最常見的語言障礙？
A. 構音異常（articulation disorder）
B. 發音失常（dysarthria）
C. 失語症（aphasia）
D. 口吃（stuttering）

正確答案：A. 構音異常（articulation disorder）